一位 68 歲女性因急性膽囊炎接受腹腔鏡膽囊切除術，在截斷 cystic artery 後，在 Calot's triangle 附近最可能會傷及下列那一條血管？
A. right hepatic artery
B. superior mesenteric vein
C. left hepatic artery
D. right renal vein

正確答案：A. right hepatic artery